Clinical trial exclusion criterion:
ventral hernia repair with mesh

Entity relations:
- AND("repair with mesh", "ventral hernia")